下列何種病毒具有雙層蛋白衣（double-layered capsid），需經胰蛋白酶消化成ISVP  （intermediate/infectious subviral particle）後才會增強其感染能力？
A. 諾羅病毒（Norovirus）
B. 輪狀病毒（Rotavirus）
C. 副流感病毒（Parainfluenza virus）
D. 麻疹病毒（Measles virus）

正確答案：B. 輪狀病毒（Rotavirus）